Clinical trial exclusion criterion:
8. Clinically relevant cardiac or pulmonary insufficiency.

Annotated entities:
- Parsing_Error: "8."
- Condition: "cardiac insufficiency"
- Condition: "pulmonary insufficiency"
- Qualifier: "Clinically relevant"